Clinical trial exclusion criterion:
Severe neutropenia

Annotated entities:
- Condition: "neutropenia"
- Qualifier: "Severe"